Clinical trial exclusion criterion:
Recipient < 14years of age

Annotated entities:
- Value: "< 14years"
- Person: "age"